Clinical trial exclusion criterion:
a history of more than two falls in the previous 12 months.

Annotated entities:
- Multiplier: "more than two"
- Condition: "falls"
- Temporal: "in the previous 12 months"
- Temporal: "history"